Clinical trial exclusion criterion:
Allergy to pivmecillinam

Annotated entities:
- Condition: "Allergy"
- Drug: "pivmecillinam"